Patients with a history of type I or type II diabetes or HbA1c greater than 6.5%.

The above is a clinical trial exclusion criterion. Annotated with entity spans:
Patients with a [Temporal: history] of [Condition: type I] or [Condition: type II diabetes] or [Measurement: HbA1c] [Value: greater than 6.5%].